Clinical trial exclusion criterion:
History or other evidence of severe retinopathy (e.g. CMV retinitis, macula degeneration) or clinically relevant ophthalmological disorder due to diabetes mellitus or hypertension

Annotated entities:
- Qualifier: "severe"
- Condition: "retinopathy"
- Condition: "CMV retinitis"
- Condition: "macula degeneration"
- Qualifier: "clinically relevant"
- Condition: "ophthalmological disorder"
- Condition: "diabetes mellitus"
- Condition: "hypertension"